Clinical trial inclusion criterion:
Willing to use the NuvaRing as directed

Entity relations:
- AND("Willing to use", "NuvaRing")